Contraindication to corticosteroid agents

The above is a clinical trial exclusion criterion. Annotated with entity spans:
[Condition: Contraindication] to [Drug: corticosteroid] agents